have HIV infection

The above is a clinical trial exclusion criterion. Annotated with entity spans:
have [Condition: HIV infection]